indications to anticoagulation at the time of enrollment or predicted appearance of such indications within the duration of the trial (eg. pulmonary embolism)

The above is a clinical trial exclusion criterion. Annotated with entity spans:
[Condition: indications] to [Procedure: anticoagulation] [Temporal: at the time of enrollment] or [Mood: predicted appearance] of such indications [Temporal: within the duration of the trial] (eg. [Condition: pulmonary embolism])